Clinical trial inclusion criterion:
Adequate hematological, hepatic, and renal function

Entity relations:
- Has_qualifier("hematological function", "Adequate")
- OR("hematological function", "renal function", "hepatic function")